Si un paciente presenta una parálisis facial que no afecta a la musculatura de la frente debemos pensar que la lesión se encuentra:
1. A nivel supranuclear.
2. En el ganglio geniculado.
3. En el foramen estilomastoideo.
4. En el ángulo pontocerebeloso.
5. En el conducto auditivo interno.

Respuesta correcta: 1. A nivel supranuclear.